Clinical trial exclusion criterion:
History of thrombophilia or anticoagulant therapy

Annotated entities:
- Condition: "thrombophilia"
- Drug: "anticoagulant therapy"